Clinical trial exclusion criterion:
Serum creatinine > 1.5 x ULN

Entity relations:
- Has_value("Serum creatinine", "> 1.5 x ULN")